Body Mass Index >35

The above is a clinical trial exclusion criterion. Annotated with entity spans:
[Measurement: Body Mass Index] [Value: >35]